嬰兒型幽門肥厚狹窄（infantile hypertrophic pyloric stenosis）的病人，其電解值的變化為何？
A. 低血鉀症鹼中毒
B. 高血鈉症鹼中毒
C. 低血鉀症酸中毒
D. 低血氯症酸中毒

正確答案：A. 低血鉀症鹼中毒